History of exposure to the following cumulative doses of anthracyclines: Doxorubicin or liposomal doxorubicin > 500 mg/m^2; epirubicin > 900 mg/m^2; mitoxantrone > 120mg/m^2 and idarubicin > 90 mg/m^2.

The above is a clinical trial exclusion criterion. Annotated with entity spans:
History of exposure to the following cumulative doses of [Drug: anthracyclines]: [Drug: Doxorubicin] or [Drug: liposomal doxorubicin] [Multiplier: > 500 mg/m^2]; [Drug: epirubicin] [Multiplier: > 900 mg/m^2]; [Drug: mitoxantrone] [Multiplier: > 120mg/m^2] and [Drug: idarubicin] [Multiplier: > 90 mg/m^2].